Clinical trial exclusion criterion:
Bifurcation lesion requiring 2 stenting technique

Entity relations:
- Has_multiplier("stenting technique", "2")
- AND("Bifurcation lesion", "stenting technique")